Clinical trial inclusion criterion:
Female patients must be postmenopausal or must have had a bilateral oophorectomy or must have been surgically sterilized or hysterectomized at least 6 months prior to screening.

Annotated entities:
- Person: "Female"
- Condition: "postmenopausal"
- Procedure: "bilateral oophorectomy"
- Procedure: "surgically sterilized"
- Procedure: "hysterectomized"
- Temporal: "at least 6 months prior to screening"